下列有關原發性中樞神經系統淋巴瘤的敘述，何者錯誤？
A. 此為免疫抑制病人最常見的中樞神經系統腫瘤
B. 中樞神經系統以外的組織亦常被侵犯
C. 絕大多數的腫瘤為B細胞淋巴瘤，且大多數細胞會表現BCL-6
D. 血管內淋巴瘤（intravascular lymphoma）通常以廣泛的微小梗塞表現，而不是以腫塊表現

正確答案：B. 中樞神經系統以外的組織亦常被侵犯